Clinical trial exclusion criterion:
Refuse to be enrolled

Annotated entities:
- Observation: "Refuse to be enrolled"